¿En cuál de los siguientes tipos de inhibición enzimática no disminuye el valor de Vmax?
1. Competitiva.
2. No competitiva.
3. Acompetitiva.
4. Mixta.
5. Disminuye en todos ellos.

Respuesta correcta: 1. Competitiva.